關於縱膈腔腫瘤之臨床症狀及診斷，下列敘述何者錯誤？
A. 臨床症狀取決於腫瘤位置，大小及惡性程度
B. 可能會有霍納氏症候群（Horner syndrome）發生
C. 胸腺瘤可能有重症肌無力症狀
D. 超過三分之二的病患會有症狀發現

正確答案：D. 超過三分之二的病患會有症狀發現